Have a history of myocardial infarction in the past 6 months

The above is a clinical trial exclusion criterion. Annotated with entity spans:
Have a history of [Condition: myocardial infarction i]n the [Temporal: past 6 months]